Clinical trial inclusion criterion:
Informed consent about histological examination (core cut biopsy (CCB), vacuum-assisted biopsy (VAB), fine needle aspiration (FNA) or surgery) has already been given in the course of clinical routine

Entity relations:
- Subsumes("histological examination", "core cut biopsy (CCB)")
- OR("core cut biopsy (CCB)", "fine needle aspiration (FNA)", "vacuum-assisted biopsy (VAB)", "surgery")